Clinical trial exclusion criterion:
receiving bismuth salts, PPIs, or antibiotics in the previous month.

Entity relations:
- Has_temporal("bismuth salts", "in the previous month")
- OR("bismuth salts", "antibiotics", "PPIs")